Clinical trial inclusion criterion:
Documented liver biopsy result consistent with PBC

Entity relations:
- AND("liver biopsy", "PBC")